Clinical trial exclusion criterion:
Undifferentiated adenocarcinoma.

Annotated entities:
- Condition: "adenocarcinoma"
- Qualifier: "Undifferentiated"